List angiotensin-converting-enzyme inhibitors.

captopril
enalapril
lisinopril
ramipril